關於肺炎黴漿菌（Mycoplasma pneumoniae）所引起的肺炎，下列何者正確？
A. 患者可使用青黴素（penicillin）、頭芽孢素（cephalosporin）或萬古黴素（vancomycin）類抗生素治療
B. 此菌具有P1黏附蛋白（P1 adhesin），能導致呼吸道中具有纖毛的上皮細胞（ciliated epithelial cells）遭致  	破壞
C. 可將患者痰液以革蘭氏染色（Gram stain）後，進行顯微鏡觀察是否有分枝纖細狀桿菌
D. 可藉由吸入受感染鳥類的乾燥糞便或其呼吸道分泌物而得到感染

正確答案：B. 此菌具有P1黏附蛋白（P1 adhesin），能導致呼吸道中具有纖毛的上皮細胞（ciliated epithelial cells）遭致  	破壞